RV3-BB vaccine is used for prevention of which viral infection?

The RV3-BB human neonatal rotavirus vaccine aims to provide protection from severe rotavirus disease from birth.